Likely to not follow the protocol

The above is a clinical trial exclusion criterion. Annotated with entity spans:
[Post-eligibility: Likely to not follow the protocol]